Clinical trial exclusion criterion:
3. intrauterine infection

Annotated entities:
- Condition: "intrauterine infection"